Para evaluar el desarrollo social en la infancia y adolescencia, ¿qué factores influyen en la selección de los procedimientos idóneos?
1. La disponibilidad de instrumentos que permitan la obtención de medidas válidas y fiables en esta área.
2. La edad del niño y de sus habilidades de expresión lingüística.
3. La naturaleza de la conducta o habilidad a evaluar, nivel de desarrollo y la forma de manifestación de la conducta, individual o en grupo.
4. Las habilidades y experiencia del evaluador con los procedimientos y las técnicas de evaluación empleadas habitualmente en esta área.
5. El acceso a pruebas estandarizadas según edad, sexo y por condiciones especiales.

Respuesta correcta: 3. La naturaleza de la conducta o habilidad a evaluar, nivel de desarrollo y la forma de manifestación de la conducta, individual o en grupo.